Clinical trial exclusion criterion:
Concomitant administration of any other experimental drug under investigation, or concomitant chemotherapy, hormonal therapy, or immunotherapy

Annotated entities:
- Drug: "experimental drug"
- Temporal: "Concomitant"
- Procedure: "chemotherapy"
- Procedure: "hormonal therapy"
- Procedure: "immunotherapy"
- Temporal: "concomitant"